Clinical trial exclusion criterion:
1. The patient is pregnant or breastfeeding.

Entity relations:
- OR("pregnant", "breastfeeding")